Which organs are primarily damaged in SLE?

In systemic lupus erythematosus (SLE), brain and kidney are the most frequently damaged organs. The heart is one of the most commonly damaged organs in SLE. Any part of the heart can be affected, including the pericardium, myocardium, coronary arteries, valves, and the conduction system